Patients who are already involved in any other trial.

The above is a clinical trial exclusion criterion. Annotated with entity spans:
[Non-query-able: Patients who are already involved in any other trial.]